Clinical trial inclusion criterion:
Children undergoing elective tonsillectomy or adenotonsillectomy at Children's Healthcare of Atlanta Egleston location

Entity relations:
- AND("tonsillectomy", "Children's Healthcare of Atlanta Egleston")
- Has_qualifier("tonsillectomy", "elective")
- OR("tonsillectomy", "adenotonsillectomy")